Clinical trial inclusion criterion:
The expected survival> 3 months;

Entity relations:
- Has_value("expected survival", "> 3 months")